Clinical trial exclusion criterion:
Cholesterol total > 300 mg/dl with or without use of statin;

Annotated entities:
- Measurement: "Cholesterol total"
- Value: "> 300 mg/dl"
- Drug: "statin"